cervicitis

The above is a clinical trial exclusion criterion. Annotated with entity spans:
[Condition: cervicitis]